負責睪丸中精子生成的兩種主要荷爾蒙為：
A. 生長激素（growth hormone）及雄性素（androgen）
B. 促濾泡素（FSH）及雄性素
C. 促濾泡素及動情素（estrogen）
D. 促甲素（TSH）及雄性素

正確答案：B. 促濾泡素（FSH）及雄性素